Which disease can be prevented with PfSPZ Vaccine?

PfSPZ Vaccine is used for prevention of malaria.